interferon ß-1a,

The above is a clinical trial inclusion criterion. Annotated with entity spans:
[Drug: interferon ß-1a],